What is MACE in the context of cardiotoxicity?

MACE is an acronym for Major Adverse Cardiovascular Events.